Clinical trial inclusion criterion:
Chronic HCV Infection of Genotype 1, 4, 5, or 6

Annotated entities:
- Condition: "Chronic HCV Infection"
- Qualifier: "Genotype 1"
- Qualifier: "Genotype 4"
- Qualifier: "Genotype 5"
- Qualifier: "Genotype 6"